Clinical trial exclusion criterion:
Subject is morbidly obese (defined as a body mass index >40, or weighs more than 100 lbs over ideal body weight).

Annotated entities:
- Condition: "morbidly obese"
- Measurement: "body mass index"
- Value: ">40"
- Measurement: "weighs"
- Value: "more than 100 lbs over ideal body weight"